懷孕 8 個月的孕婦不幸由 5 公尺高墜落，下列敘述何者錯誤？
A. 最有效的胎兒急救，便是先維持孕婦的生命徵象穩定
B. 孕婦急救時，如無脊椎損傷，側躺時左側在上，防止子宮壓迫主動脈
C. 也需要監測胎兒的心跳
D. 縱使母親生命徵象穩定，胎兒卻可能處於休克中

正確答案：B. 孕婦急救時，如無脊椎損傷，側躺時左側在上，防止子宮壓迫主動脈